Clinical trial exclusion criterion:
Hepatic encephalopathy

Annotated entities:
- Condition: "Hepatic encephalopathy"